一般寄主對病毒感染的免疫反應，下列那一項敘述不正確？
A. 抗體在急性感染期有阻斷病毒入侵寄主細胞的作用
B. 在病毒建立感染後，細胞媒介的反應對清除病毒的作用比較重要
C. 個體若有補體系統基因的缺損，並不會造成嚴重的病毒感染
D. 介白質-10（interleukin-10）是主要可以活化自然殺手細胞的細胞激素

正確答案：D. 介白質-10（interleukin-10）是主要可以活化自然殺手細胞的細胞激素